Clinical trial exclusion criterion:
gastric/duodenal ulcer

Entity relations:
- OR("gastric ulcer", "duodenal ulcer")